En el oído de mamíferos:
1. Los esterocilios de las células ciliadas contactan con la membrana basilar.
2. La rampa timpánica contiene endolinfa.
3. La membrana basilar es más ancha y flexible a nivel del helicotrema.
4. Las células sensoriales son las de Deiter.
5. La membrana oval tiene mayor superficie que la timpánica.

Respuesta correcta: 3. La membrana basilar es más ancha y flexible a nivel del helicotrema.